Clinical trial exclusion criterion:
Subjects who have human Immunodeficiency virus (HIV), hepatitis B virus (HBV), and hepatitis C virus (HCV)

Entity relations:
- OR("human Immunodeficiency virus (HIV)", "hepatitis C virus (HCV)", "hepatitis B virus (HBV)")